足月時，臀位產的發生率約為多少？
A. 0.5%
B. 4.0%
C. 8.0%
D. 12.0%

正確答案：B. 4.0%